Queremos conocer si el consumo de café puede estar asociado a la malformación neonatal por lo que se diseña un estudio casos control. Se entrevista a un grupo de mujeres que han tenido niños con malformaciones y lo mismo en un grupo de madres sin hijos con malformaciones. Las entrevistas las realizaran dos entrevistadores entrenados mediante un cuestionario previamente validado. Además, los entrevistadores ignoran si la entrevistada es un caso o un control. ¿Qué tipo de sesgo podemos introducir?
1. Sesgo de información.
2. Sesgo de memoria.
3. Sesgo del entrevistador.
4. Sesgo de selección.
5. Falacia ecológica.

Respuesta correcta: 2. Sesgo de memoria.